Are undergoing an acute withdrawal syndrome from drugs or alcohol.

The above is a clinical trial exclusion criterion. Annotated with entity spans:
Are undergoing an [Condition: acute withdrawal syndrome] from [Drug: drugs] or [Drug: alcohol].